Clinical trial exclusion criterion:
Subjects with severe kidney disease

Annotated entities:
- Qualifier: "severe"
- Condition: "kidney disease"